Clinical trial inclusion criterion:
ASA I-IV Age 55 or older Scheduled for operative repair of isolated intertrochanteric hip fracture

Entity relations:
- Has_value("Age", "55 or older")
- Has_qualifier("intertrochanteric hip fracture", "isolated")
- AND("operative repair", "intertrochanteric hip fracture")
- multi("isolated", "isolated")
- Has_mood("operative repair", "Scheduled for")
- Has_value("ASA", "I-IV")